Clinical trial exclusion criterion:
2. Screening tool: TMS safety screening questionnaire.

Annotated entities:
- Parsing_Error: "2."
- Procedure: "TMS safety screening questionnaire"
- Not_a_criteria: "Screening tool: TMS safety screening questionnaire."
- Parsing_Error: "Screening tool: TMS safety screening questionnaire."